Urinary cotinine levels indicative of smoking or history or regular use of tobacco- or nicotine-containing products within 6 months prior to screening.

The above is a clinical trial exclusion criterion. Annotated with entity spans:
[Measurement: Urinary cotinine levels] indicative of [Condition: smoking] or [Temporal: history] or [Condition: regular use of tobacco]- or nicotine-containing products [Temporal: within 6 months prior to screening].